Clinical trial inclusion criterion:
a high risk profile of the patient, defined as a CHA2DS2-VASc score = 3 and a HAS-BLED score = 2

Annotated entities:
- Measurement: "CHA2DS2-VASc score"
- Value: "= 3"
- Measurement: "HAS-BLED score"
- Value: "= 2"
- Condition: "high risk profile"